有關麻醉中病人之體溫監測敘述，下列何者錯誤？
A. 核心溫度（core temperature）比較穩定，常用的測量部位包括nasopharynx
B. 麻醉中常見的體溫異常，hypothermia多於hyperthermia
C. rectal temperature在施行體外循環時，反應速度比核心溫度慢
D. 全身麻醉都應監測病人體溫，但區域麻醉（regional anesthesia）可不必監測

正確答案：D. 全身麻醉都應監測病人體溫，但區域麻醉（regional anesthesia）可不必監測